¿Qué trastorno mental se define por la presencia de atracones junto con el uso de métodos compensatorios inapropiados para evitar la ganancia de peso?
1. Anorexia Nerviosa sin amenorrea.
2. Trastorno por atracón.
3. Bulimia nerviosa.
4. Obesidad.
5. Comedor compulsivo.

Respuesta correcta: 3. Bulimia nerviosa.